有關腎細胞癌（renal cell carcinoma）所引起全身性臨床症狀，下列何者錯誤？
A. paraneoplastic syndrome會發生在大約20%腎細胞癌之病人
B. paraneoplastic syndrome最常表現的全身性症候群是紅血球沉澱速率（ESR）升高
C. paraneoplastic syndrome最常發生的臨床症狀是高鈣血症，其次是高血壓
D. 高血鈣症發生率可高達13%，其原因係paraneoplastic phenomena或骨轉移造成之骨質溶解

正確答案：C. paraneoplastic syndrome最常發生的臨床症狀是高鈣血症，其次是高血壓